History of clinically significant disease, including any cardiovascular, hepatic, renal, respiratory, hematologic, endocrinologic, or neurologic disease, or clinically significant laboratory abnormality that is not stabilized or is anticipated to require treatment during the study.

The above is a clinical trial exclusion criterion. Annotated with entity spans:
History of [Qualifier: clinically significant] [Condition: disease], including any [Condition: cardiovascular], [Condition: hepatic], [Condition: renal], [Condition: respiratory], [Condition: hematologic], [Condition: endocrinologic], or [Condition: neurologic disease], or [Qualifier: clinically significant] [Condition: laboratory abnormality] that is [Negation: not] [Qualifier: stabilized] or is [Mood: anticipated to require] [Procedure: treatment] [Temporal: during the study].